Clinical trial inclusion criterion:
presence of benign cause for the hysterectomy e.g. fibroid uterus, perimenopausal beeding not responding to medical treatment or complex endometrial hyperplasia without atypia.

Entity relations:
- multi("responding to medical treatment", "medical treatment")
- Has_negation("atypia", "without")
- AND("complex endometrial hyperplasia", "atypia")
- AND("benign cause", "hysterectomy")
- Has_qualifier("perimenopausal beeding", "responding to medical treatment")
- Has_negation("responding to medical treatment", "not")
- Subsumes("benign cause", "fibroid uterus")
- OR("fibroid uterus", "perimenopausal beeding", "complex endometrial hyperplasia")